Clinical trial inclusion criteria:
a very high cardiovascular risk and LDL-cholesterol> 1.8 mmol / l
a high cardiovascular risk and LDL-cholesterol> 2.5 mmol / l
Patient with a high or very high cardiovascular risk treated by lipidlowering therapy with statin

Annotated entities:
- Condition: "cardiovascular risk"
- Qualifier: "very high"
- Measurement: "LDL-cholesterol"
- Value: "> 1.8 mmol / l"
- Condition: "cardiovascular risk"
- Qualifier: "high"
- Measurement: "LDL-cholesterol"
- Value: "> 2.5 mmol / l"
- Qualifier: "very high"
- Qualifier: "high"
- Condition: "cardiovascular risk"
- Procedure: "lipidlowering therapy"
- Drug: "stati"